Hormone Replacement Therapy or oral contraceptive usage

The above is a clinical trial exclusion criterion. Annotated with entity spans:
[Procedure: Hormone Replacement Therapy] or [Drug: oral contraceptive] usage